Clinical trial exclusion criterion:
Patients with uninvestigated macroscopic hematuria

Annotated entities:
- Condition: "macroscopic hematuria"
- Qualifier: "uninvestigated"